4. Other medical complications that might preclude one from participating in the study, i.e., recent heart attack or stroke or chronic kidney disease.

The above is a clinical trial exclusion criterion. Annotated with entity spans:
4. [Qualifier: Other] [Condition: medical complications] that might [Negation: preclude] one from [Informed_consent: participating in the study], i.e., [Temporal: recent] [Condition: heart attack] or [Condition: stroke] or [Condition: chronic kidney disease].